Clinical trial exclusion criterion:
Clinically significant medical history

Entity relations:
- Has_qualifier("medical history", "Clinically significant")